Clinical trial exclusion criterion:
Any clinically significant laboratory test result

Entity relations:
- Has_qualifier("laboratory test", "clinically significant")